En la protrombina, la reacción de conversión de glutamato en γ-carboxiglutamato es dependiente de:
1. Vitamina K.
2. Vitamina D.
3. Vitamina A.
4. Vitamina C.
5. Vitamina E.

Respuesta correcta: 1. Vitamina K.